What are the breath test biomarkers of pulmonary tuberculosis

Nitric oxide, urea, volatile organic compounds, hydrogen peroxide and end products of lipid peroxidation are the breath test biomarkers of pulmonary tuberculosis.